單純性大動脈血管轉位症（Transposition of great arteries）之手術治療，目前以何種方式最適合？
A. Senning 術式（Atrial switch）
B. Rastelli 術式
C. Jatene 術式（Arterial switch）
D. Blalock-Hannon 術式

正確答案：C. Jatene 術式（Arterial switch）